對於慢性胰臟炎導致的吸收不良及腹瀉之治療方法，下列何項不妥？
A. Acid-inhibiting agents
B. 低脂肪飲食
C. 脂肪酶口服製劑
D. 低糖飲食

正確答案：D. 低糖飲食